Clinical trial exclusion criterion:
Acute myocardial infarction or acute coronary syndrome, transient ischemic attack or stroke within the last 3 months.

Annotated entities:
- Condition: "Acute myocardial infarction"
- Condition: "acute coronary syndrome"
- Condition: "transient ischemic attack"
- Condition: "stroke"
- Temporal: "within the last 3 months"
- Reference_point: "the last 3 months"